Clinical trial exclusion criterion:
Allergy to local anesthetics

Annotated entities:
- Procedure: "local anesthetics"
- Condition: "Allergy"